注意力缺乏過動症（attention-deficit / hyperactivity disorder）的流行病學統計中，性別比例為何？
A. 男多於女
B. 女多於男
C. 男女相當
D. 目前無一致性定論

正確答案：A. 男多於女